最常見之肌失養症（muscular dystrophy）為：
A. Duchenne muscular dystrophy
B. fascioscapulohumeral dystrophy
C. limb girdle muscular dystrophy
D. myotonic muscular dystrophy

正確答案：A. Duchenne muscular dystrophy